Please list the syndromes that are part of Castleman's disease AKA TAFRO

TAFRO syndrome is defined as CD with thrombocytopenia, anasarca, fever, reticulin fibrosis, and organomegaly.